Clinical trial exclusion criterion:
PRA > 50%

Annotated entities:
- Measurement: "PRA"
- Value: "> 50%"